Free of obvious health problems as established by medical history and clinical examination before entering into the study.

The above is a clinical trial inclusion criterion. Annotated with entity spans:
[Negation: Free] of [Qualifier: obvious] [Condition: health problems] as established by medical history and clinical examination before entering into the study.